Clinical trial exclusion criterion:
Women with previous radiation above the diaphragm, and below the neck

Annotated entities:
- Procedure: "radiation"
- Qualifier: "above the diaphragm"
- Qualifier: "below the neck"
- Qualifier: "previous"
- Person: "Women"